一名 25 歲女性，抱怨最近進行性行為時會有疼痛的情形發生。檢查發現右側小陰唇的後側方有局部紅腫的現象，且在觸診時有明顯壓痛情形。手術切除了一個 3 公分大小、內部充滿膿液的囊腫。下列何者是最可能的診斷？
A. Bartholin's gland cyst
B. Gartner duct cyst
C. Papillary hidradenoma
D. Urachal cyst

正確答案：A. Bartholin's gland cyst